Clinical trial exclusion criterion:
Patients with >14 follicles on day of trigger

Entity relations:
- Has_value("follicles", ">14")
- Has_index("on day of trigger", "day of trigger")
- Has_temporal("follicles", "on day of trigger")